Persons directly involved in the execution of this protocol.

The above is a clinical trial exclusion criterion. Annotated with entity spans:
[Non-query-able: Persons directly involved in the execution of this protocol.]